Clinical trial inclusion criterion:
dental extraction performed at least 3 month prior

Entity relations:
- Has_temporal("dental extraction", "at least 3 month prior")